Clinical trial exclusion criterion:
Patients who has acute cholecystitis,pancreatitis,pancreaticobiliary diseases, especially choledocholithiasis.

Entity relations:
- OR("acute cholecystitis", "pancreatitis", "pancreaticobiliary diseases", "choledocholithiasis")